Which computational methods are used for the definition of synteny?

Computational methods used for the definition of synteny include multisyn, poff, orthocluster, phyldiag, synblast, cinteny, domainmanagement, electrophobicity, run orthoclustereddb, mcScan and view synteny.